一位 40 歲男性，診斷為急性闌尾炎而接受闌尾切除手術。病理檢查時，在闌尾尾端可見一個 1 公分大、界限明顯的淡黃色實體腫瘤。鏡下，腫瘤細胞有粉紅色顆粒樣細胞質，且細胞彼此間形態一致。 下列何者是最可能的診斷？
A. 類癌瘤（carcinoid tumor）
B. 惡性淋巴瘤（malignant lymphoma）
C. 轉移性腺癌（metastatic adenocarcinoma）
D. 黃色瘤（xanthoma）

正確答案：A. 類癌瘤（carcinoid tumor）